有關肥厚型心肌病變（hypertrophic cardiomyopathy）的特徵，何者錯誤？
A. β-myosin heavy chain的基因產生突變是最常見的原因
B. 年輕人猝死的常見原因之一
C. 左心室游離壁（left ventricular free wall）增厚程度比心室中隔（ventricular septum）增厚程度要來得明顯
D. 主動脈開口附近心室變厚導致左心室流出通道阻塞（left ventricular outflow tract obstruction）是常見的特徵

正確答案：C. 左心室游離壁（left ventricular free wall）增厚程度比心室中隔（ventricular septum）增厚程度要來得明顯